Clinical trial exclusion criterion:
Hypertriglyceridemic (>400 mg/dl) and hypercholesterolemic (>260 mg/dl) subjects

Entity relations:
- Has_value("Hypertriglyceridemic", ">400 mg/dl")
- multi("Hypertriglyceridemic", "Hypertriglyceridemic")
- Has_value("cholesterol", ">260 mg/dl")
- multi("hypercholesterolemic", "cholesterol")
- OR("Hypertriglyceridemic", "hypercholesterolemic")